Clinical trial exclusion criterion:
The diagnosis of developmental delay, attention deficit disorder, chronic pain, psychiatric illness, previous open abdominal surgery, the presence of a gastrostomy, ventricular-peritoneal shunt or other abdominal prosthesis, immunosuppression, and those allergic to any of the medications.

Entity relations:
- AND("allergic", "any of the medications")
- Has_temporal("open abdominal surgery", "previous")
- OR("developmental delay", "gastrostomy", "attention deficit disorder", "chronic pain", "psychiatric illness", "ventricular-peritoneal shunt", "abdominal prosthesis", "immunosuppression", "allergic", "open abdominal surgery")